Clinical trial exclusion criterion:
Patients with symptomatic CNS metastases or leptomeningeal involvement

Annotated entities:
- Condition: "CNS metastases"
- Condition: "leptomeningeal involvement"
- Qualifier: "symptomatic"